一位 54 歲男性病人主訴血尿，由膀胱鏡檢及經尿道膀胱腫瘤切除術（transurethral resection of urinary bladder tumor），病理報告為膀胱尿路細胞癌（urothelial carcinoma），侵犯到黏膜下 lamina propria，但整個切片看不到肌肉層組織。下列處置何者最適宜？
A. 按表淺層膀胱尿路細胞癌處理
B. 按侵犯型膀胱尿路細胞癌處理
C. 膀胱切除術
D. 找適當時機再做膀胱鏡檢及經尿道膀胱腫瘤刮除術，重新做病理分期

正確答案：D. 找適當時機再做膀胱鏡檢及經尿道膀胱腫瘤刮除術，重新做病理分期